Female participants must use a contraceptive method.

The above is a clinical trial inclusion criterion. Annotated with entity spans:
[Person: Female] participants must use a [Procedure: contraceptive method].